Clinical trial inclusion criterion:
Frozen embryo transfer cycles: at least 2 embryos

Annotated entities:
- Procedure: "Frozen embryo transfer cycles"
- Multiplier: "at least 2"
- Condition: "embryos"